Clinical trial inclusion criterion:
Patient presented for induction of labor who is determined to be a candidate for oxytocin

Annotated entities:
- Procedure: "induction of labor"
- Mood: "presented for"
- Condition: "candidate for oxytocin"
- Drug: "oxytocin"